Clinical trial inclusion criterion:
Completed the CRISS questionnaire at Visit 1 and Visit 2 and willing to complete the Cystic Fibrosis Respiratory Symptoms Diary (CFRSD) questionnaire at Visit 3

Entity relations:
- Has_index("at Visit 1", "Visit 1")
- Has_temporal("CRISS questionnaire", "at Visit 1")
- Has_mood("Cystic Fibrosis Respiratory Symptoms Diary (CFRSD) questionnaire", "willing to complete")
- Has_index("at Visit 3", "Visit 3")
- Has_temporal("Cystic Fibrosis Respiratory Symptoms Diary (CFRSD) questionnaire", "at Visit 3")
- Has_temporal("CRISS questionnaire", "at Visit 2")
- OR("at Visit 2", "Visit 2")